Patients with uncontrolled congestive heart failure (NYHA Class IV)

The above is a clinical trial exclusion criterion. Annotated with entity spans:
Patients with [Qualifier: uncontrolled] [Condition: congestive heart failure] ([Measurement: NYHA] [Value: Class IV])